enter the operating room by himself without parents

The above is a clinical trial inclusion criterion. Annotated with entity spans:
[Non-query-able: enter the operating room by himself without parents]